Which proteins does p110α interact with?

RAS interaction with PI3K p110α